Clinical trial exclusion criterion:
Clinically significant findings on exam or ultrasound, such as salpingitis, hydrosalpynx or evidence of ovarian cysts

Annotated entities:
- Qualifier: "Clinically significant"
- Procedure: "exam"
- Procedure: "ultrasound"
- Condition: "salpingitis"
- Condition: "hydrosalpynx"
- Condition: "ovarian cysts"
- Mood: "evidence"
- Observation: "findings"